What is the role of photodynamic therapy for meningioma treatment?

Photodynamic therapy was shown to have activity againt meningioma treatment. Gefitinib and ciprofloxacin enhance efficacy of photodynamic therapy.